Clinical trial exclusion criterion:
History of local radiation therapy in the last five years.

Annotated entities:
- Procedure: "local radiation therapy"
- Temporal: "last five years"